下列關於乾癬（psoriasis）的敘述，何者錯誤？
A. 好發於兒童
B. 好發部位為頭部、肘膝和軀幹
C. 部分病人會合併乾癬性關節炎（psoriatic arthritis）
D. 病灶特徵為境界鮮明、表面有白色	屑之紅色斑塊

正確答案：A. 好發於兒童